Which disease is associated with X-linked recessive TLR7 deficiency?

COVID-19 pneumonia